Clinical trial exclusion criterion:
History of gastrointestinal malabsorption or gastric bypass surgery

Entity relations:
- OR("gastrointestinal malabsorption", "gastric bypass surgery")